Clinical trial exclusion criterion:
Patients who experienced organ failure by acute exacerbation of liver cirrhosis within the past 1 month

Annotated entities:
- Condition: "organ failure"
- Condition: "acute exacerbation of liver cirrhosis"
- Temporal: "past 1 month"